La solubilidad del hidróxido de cobre en presencia de una concentración elevada de amoníaco:
1. Aumenta por formación de un ion complejo de Cu2+ con NH3.
2. No se ve afectada al no producirse efecto de ion común.
3. Disminuye por efecto de ion común.
4. Disminuye al producirse la oxidación de bromuro a bromo molecular.
5. Disminuye porque los hidróxidos son más solubles en medio ácido.

Respuesta correcta: 1. Aumenta por formación de un ion complejo de Cu2+ con NH3.